Clinical trial exclusion criterion:
Nicotine addiction

Annotated entities:
- Condition: "Nicotine addiction"